¿Cuál es el grupo prostético de la proteína transportadora de grupos acilo (ACP) en la biosíntesis de ácidos grasos?:
1. El ácido lipoico.
2. El ácido pantoténico.
3. La acil-carnitina.
4. La 4´-fosfopanteteína.

Respuesta correcta: 4. La 4´-fosfopanteteína.